Clinical trial exclusion criterion:
Refusal of village chief

Annotated entities:
- Non-query-able: "Refusal of village chief"